What is the mode of action of filgotinib?

Filgotinib (GLPG0634) is a selective inhibitor of Janus kinase 1 (JAK1).